Clinical trial inclusion criterion:
Has Eastern Cooperative Oncology Group (ECOG) performance status of 0 or 1 performed within 7 days prior to receiving the first dose of study medication

Annotated entities:
- Measurement: "Eastern Cooperative Oncology Group (ECOG) performance status"
- Value: "0 or 1"
- Temporal: "within 7 days prior"
- Reference_point: "receiving the first dose of study medication"